下列關於胃發育之敘述，何者正確？
A. 背側緣形成胃小彎（lesser curvature）
B. 胃大彎（greater curvature）轉向左側
C. 原來之左側轉為背側
D. 胃背繫膜（dorsal mesogastrium）形成小網膜（lesser omentum）

正確答案：B. 胃大彎（greater curvature）轉向左側